Clinical trial inclusion criterion:
Informed consent received

Annotated entities:
- Informed_consent: "Informed consent received"